General state with Karnowsky greater than 80, ECOG = 0, 1 or 2.

The above is a clinical trial inclusion criterion. Annotated with entity spans:
General state with [Measurement: Karnowsky] [Value: greater than 80], [Measurement: ECOG] = [Value: 0, 1 or 2].